Clinical trial inclusion criterion:
For women of childbearing potential and men with partners of childbearing potential, agreement to use a highly effective, non-hormonal form of contraception or 2 effective forms of non-hormonal contraception by the patient and/or partner. Contraception use must continue for the duration of study treatment and for at least 6 months after the last dose of study treatment. Male patients whose partners are pregnant should use condoms for the duration of the study.

Entity relations:
- Has_qualifier("contraception", "non-hormonal")
- Has_qualifier("contraception", "highly effective")
- Has_multiplier("non-hormonal contraception", "2")
- Has_index("continue for the duration of study treatment", "study treatment")
- Has_index("for at least 6 months after the last dose of study treatment", "the last dose of study treatment")
- Has_temporal("Contraception", "continue for the duration of study treatment")
- Has_temporal("Contraception", "for at least 6 months after the last dose of study treatment")
- Has_temporal("condoms", "for the duration of the study")
- AND("Male", "condoms")
- AND("partners are pregnant", "condoms")
- OR("women", "men")
- OR("contraception", "non-hormonal contraception")
- OR("childbearing potential", "men")